In which cellular compartment do stress granules localize?

cytoplasm